糖皮質素（glucocorticoids）在炎症細胞（inflammatory cells）中，透過下列何種主要的作用機轉來產生抗發炎作用？
A. 抑制 phospholipase A2 的活性
B. 抑制 phospholipase C 的活性
C. 促進 phospholipase A2 的活性
D. 促進 phospholipase C 的活性

正確答案：A. 抑制 phospholipase A2 的活性